下列何者不是吸入性麻醉劑引起肝功能損傷的危險因素？
A. 肥胖
B. 年齡
C. 身高
D. 基因遺傳

正確答案：C. 身高